Clinical trial inclusion criterion:
Age 18 or older.

Annotated entities:
- Person: "Age"
- Value: "18 or older"